Existing sacral pressure ulcer, undergoing a cardiac procedure, or inability to provide informed consent.

The above is a clinical trial exclusion criterion. Annotated with entity spans:
Existing [Condition: sacral pressure ulcer], undergoing a [Procedure: cardiac procedure], or [Condition: inability to provide informed consent].